Clinical trial exclusion criterion:
10. Myocardial infarction within the past 6 months.

Entity relations:
- Has_temporal("Myocardial infarction", "within the past 6 months")